Focal laser photocoagulation or intravitreal/periocular steroids of any type in the study eye within the last 90 days prior to study enrollment.

The above is a clinical trial exclusion criterion. Annotated with entity spans:
[Procedure: Focal laser photocoagulation] or [Drug: intravitreal/periocular steroids] of any type [Qualifier: in the study eye] [Temporal: within the last 90 days prior to study enrollment].